Clinical trial exclusion criterion:
Women who are breastfeeding

Annotated entities:
- Person: "Women"
- Observation: "breastfeeding"